Clinical trial inclusion criterion:
Type 2 DM

Annotated entities:
- Condition: "Type 2 DM"